Clinical trial exclusion criterion:
Patient received acetaminophen within the past 4 hours

Annotated entities:
- Drug: "acetaminophen"
- Temporal: "within the past 4 hours"